45歲膽囊炎切除後的男性病人，回到病房後，主治醫師發現術後追蹤的腹部X光片，有紗布殘留。下列敘述何者錯誤？
A. 向病人隱瞞醫療上發生的錯誤，可能會削弱大眾對於醫學的信賴
B. 當病人受到醫療傷害時，他們有權尋求適度的矯正或賠償
C. 為提升醫療品質，減少醫療錯誤的發生，應建立懲罰性的醫療錯誤通報制度
D. 醫師應盡力不要以自我辯護或推諉卸責的方式進行告知

正確答案：C. 為提升醫療品質，減少醫療錯誤的發生，應建立懲罰性的醫療錯誤通報制度